針對治療新生兒缺血缺氧腦病變（hypoxic-ischemic encephalopathy）的描述，下列何者錯誤？
A. 降低體溫是保護腦部及減少腦傷的一種可行性治療方法
B. 靜脈注射 phenobarbital 是抑制抽搐（seizure）發生的第一線治療藥物
C. 需注意低血糖及低血鈣之發生
D. 心臟等其他器官的受損情況不會影響治療之預後

正確答案：D. 心臟等其他器官的受損情況不會影響治療之預後